下列何種藥物可以有效地治療犬絛蟲（Echinococcus granulosus）所造成的肝囊腫？
A. Albendazole
B. Ivermectin
C. Oxamniquine
D. Niclosamide

正確答案：A. Albendazole